Uncontrolled hypertension with systolic BP >160 mmHg or diastolic BP >95 mmHg.

The above is a clinical trial exclusion criterion. Annotated with entity spans:
[Qualifier: Uncontrolled] [Condition: hypertension] with [Measurement: systolic BP] [Value: >160 mmHg] or [Measurement: diastolic BP] [Value: >95 mmHg].